En el área de salud, se identifican problemas de seguridad en dos centros escolares. Para abordar la situación se desarrollan sesiones educativas con padres-madres y profesores de los centros, se elaboran carteles de prevención, se recogen firmas para apoyar la eliminación de los puntos negros y se consigue terminar con los riesgos y crear una normativa que favorezca la seguridad de los centros escolares. Este tipo de intervención se considera:
1. Promoción de la salud.
2. Consejo e información.
3. Educación para la salud individual.
4. Educación para la salud grupal.
5. Educación para la salud masiva.

Respuesta correcta: 1. Promoción de la salud.